Clinical trial inclusion criterion:
Less than or equal to (<=) 1 previous failed embryo transfer

Entity relations:
- Has_value("previous failed embryo transfer", "Less than or equal to (<=) 1")